Clinical trial exclusion criterion:
Blood glucose < 50 mg/dL (2.7mmol/L);

Annotated entities:
- Measurement: "Blood glucose"
- Value: "< 50 mg/dL"
- Value: "2.7mmol/L"